Clinical trial exclusion criterion:
Persons referred to in Articles L1121-5 to L1121-8 of the French Public health Code: pregnant woman, parturient, nursing mother, person deprived of liberty by judicial or administrative decision, person subject to a legal protection measure, can not Be included in clinical trials.

Annotated entities:
- Context_Error: "Persons referred to in Articles L1121-5 to L1121-8 of the French Public health Code"
- Condition: "pregnant"
- Person: "woman"
- Condition: "parturient"
- Condition: "nursing"
- Observation: "deprived of liberty"
- Observation: "subject to a legal protection"